Clinical trial exclusion criterion:
Participation in any clinical investigation within 4 weeks prior to dosing or longer if required by local regulation.

Annotated entities:
- Temporal: "within 4 weeks prior to dosing"
- Competing_trial: "any clinical investigation"
- Reference_point: "dosing"